下列對麻瘋分枝桿菌（Mycobacterium leprae）之敘述，何者正確？
A. 可在麻瘋瘤型麻瘋（lepromatous leprosy）病人的黏膜抹片或皮膚括取物中被發現
B. 已經成功的在培養基中培養出來
C. 生長速度快，因此潛伏期很短
D. 並非典型的耐酸性染色菌

正確答案：A. 可在麻瘋瘤型麻瘋（lepromatous leprosy）病人的黏膜抹片或皮膚括取物中被發現